Which signaling pathway does LY294002 inhibit?

LY294002, can block the PI3K/AKT signaling pathway.